有關 DNA 與 RNA 的敘述，下列何者錯誤？
A. DNA 由去氧核糖核酸組成，RNA 由核糖核酸組成
B. 在弱鹼溶液中，RNA 較 DNA 穩定
C. 雙股 DNA 大多以 B form 二級結構存在
D. DNA 與 RNA 皆用磷酸二酯鍵（phosphodiester bond）形成聚合體

正確答案：B. 在弱鹼溶液中，RNA 較 DNA 穩定